Clinical trial exclusion criterion:
Already on medications that may affect thyroid function (L-T4, carbimazole, propylthiouracil, amiodarone, lithium).

Annotated entities:
- Drug: "medications"
- Measurement: "thyroid function"
- Value: "affect"
- Drug: "L-T4"
- Drug: "carbimazole"
- Drug: "propylthiouracil"
- Drug: "amiodarone"
- Drug: "lithium"